當細菌的 23S rRNA 和核糖體蛋白（ribosomal proteins）發生突變時，可造成細菌對下列何種抗生素產生抗藥性？
A. 環丙沙星（ciprofloxacin）
B. 利肺寧（rifampin）
C. 青黴素（penicillin）
D. 紅黴素（erythromycin）

正確答案：D. 紅黴素（erythromycin）